Current or planned psychotherapy

The above is a clinical trial exclusion criterion. Annotated with entity spans:
[Temporal: Current] or [Mood: planned] [Procedure: psychotherapy]